Women who are pregnant or nursing

The above is a clinical trial exclusion criterion. Annotated with entity spans:
[Person: Women] who are [Condition: pregnant] or [Condition: nursing]